Clinical trial exclusion criterion:
Patients with any macular changes prior to the surgery (epiretinal membranes, age macular disease, macular edema...)

Entity relations:
- Has_qualifier("macular changes", "any")
- Has_index("prior to the surgery", "the surgery")
- multi("the surgery", "surgery")
- Has_temporal("macular changes", "prior to the surgery")
- Subsumes("macular changes", "epiretinal membranes")
- OR("epiretinal membranes", "age macular disease", "macular edema")